關於睡眠障礙，下列何者正確？
A. 睡眠驚恐症（sleep terror）常發生於睡眠的後半夜
B. 夢遊（sleepwalking）主要發生於快速動眼期（REM period）
C. 夢魘（噩夢，nightmare）主要發生於非快速動眼期（NREM ）
D. 睡眠驚恐症（sleep terror）常發生於非快速動眼期的深睡期（deep NREM sleep）

正確答案：D. 睡眠驚恐症（sleep terror）常發生於非快速動眼期的深睡期（deep NREM sleep）